下列何者無分枝供應腎上腺？
A. 下膈動脈
B. 腹主動脈
C. 腎動脈
D. 睪丸動脈

正確答案：D. 睪丸動脈